以預防醫學的角度觀之，具低風險因子且大於 35 歲的男性，應該多久接受一次膽固醇（cholesterol）抽血檢查？
A. 三個月
B. 六個月
C. 一年
D. 五年

正確答案：D. 五年